Clinical trial exclusion criterion:
Any confirmed or suspected immunosuppressive or immunodeficient condition based on medical history and physical

Annotated entities:
- Condition: "immunosuppressive condition"
- Condition: "immunodeficient condition"